Clinical trial exclusion criterion:
Age under 18 years

Entity relations:
- Has_value("Age", "under 18 years")